有關靜脈麻醉藥物 thiopental 的作用之敘述，下列何者錯誤？
A. 低劑量時作用是 sedation，高劑量時可達 hypnosis 作用
B. 給予成人劑量 2.5 mg/kg 有良好止痛作用
C. 用於腦創傷的病人，可降低腦壓，具有保護神經的作用
D. 為鹼性製劑，須以 isotonic sodium chloride，勿用 Ringer's lactate 調配

正確答案：B. 給予成人劑量 2.5 mg/kg 有良好止痛作用